Clinical trial exclusion criterion:
2. Recipients of previous non-renal solid organ and/or islet cell transplantation.

Entity relations:
- Has_temporal("non-renal solid organ transplantation", "previous")
- OR("non-renal solid organ transplantation", "islet cell transplantation")